Clinical trial exclusion criterion:
Current or past psychosis

Annotated entities:
- Condition: "psychosis"
- Temporal: "past"
- Temporal: "Current"